Lactante de 5 meses de edad alimentado con lactancia materna exclusiva hasta la actualidad que por motivo de trabajo materno se le introduce biberón con fórmula de inicio y hace unos día se le adiciona con cereales con y sin gluten. Como antecedentes familiares destaca madre de 28 años asmática, padre de 32 años sano y hermano de 5 años afecto de enfermedad celíaca y dermatitis atópica. Como antecedentes personales, embarazo sin incidencias y parto mediante cesárea habiéndosele ofrecido biberón con fórmula de inicio el primer día de vida en la maternidad. Desde hace unos días comienza con distensión abdominal, deposiciones diarreicas, rechazo a las tomas, eritema peribucal con duración más prolongada en el tiempo tras la ingesta del biberón y últimamente vómitos tras su ingesta, tolerando bien el pecho materno. ¿Cuál es su diagnóstico más probable?
1. Enfermedad celíaca.
2. Gastroenteritis aguda.
3. Alergia a las proteínas de la leche de vaca.
4. Alergia a los biberones.

Respuesta correcta: 3. Alergia a las proteínas de la leche de vaca.